下列有關耳朵（ear）發育之敘述，何者錯誤？
A. 外耳道（external acoustic meatus）源自第一對咽溝（pharyngeal groove）
B. 鼓膜主要來自第一對咽膜（pharyngeal membrane）與咽囊（pharyngeal pouch）及間葉組織
C. 鼓室（tympanic cavity）源自第一對咽囊（pharyngeal pouch）
D. 第一對咽囊（pharyngeal pouch）向下與第二對咽囊連通形成耳咽管（auditory tube）並開口於鼻咽

正確答案：D. 第一對咽囊（pharyngeal pouch）向下與第二對咽囊連通形成耳咽管（auditory tube）並開口於鼻咽